eGFR(Epidermal growth factor receptor) < 50mL/min

The above is a clinical trial exclusion criterion. Annotated with entity spans:
[Measurement: eGFR]([Measurement: Epidermal growth factor receptor]) [Value: < 50mL/min]